Clinical trial inclusion criterion:
patients with stable coronary artery disease referred to PCI in an artery suitable for IVUS pullback;

Annotated entities:
- Qualifier: "stable"
- Condition: "coronary artery disease"
- Procedure: "PCI"
- Mood: "referred to"
- Qualifier: "artery suitable for IVUS pullback"